Of what origin is the MCF-7 cell line?

MCF7 is an ER+ breast cancer cell line.